根據 Japanese Society for Gastrointestinal Endoscopy 制定的準則，須符合某些標準才能使用 endoscopic mucosal resection（EMR）治療食道癌（esophageal cancer），下列何者錯誤？
A. 腫瘤大小≦2 cm
B. 腫瘤侵犯食道壁小於三分之一圈（circumference）
C. 腫瘤侷限於食道黏膜層（mucosa）
D. 腫瘤侷限在中上段食道

正確答案：D. 腫瘤侷限在中上段食道